在第三週胚齡時，下列何者之含氧量最高？
A. 卵黃靜脈（vitelline v.）
B. 總主靜脈（common cardinal v.）
C. 臍靜脈（umbilical v.）
D. 前主靜脈（anterior cardinal v.）

正確答案：C. 臍靜脈（umbilical v.）